Acute myocardial infarction < 12 h defined as:

The above is a clinical trial inclusion criterion. Annotated with entity spans:
[Condition: Acute myocardial infarction] [Temporal: < 12 h] defined as: